Acude a consulta de enfermería una mujer de 57 años con antecedentes de HTA grado 1, controlada con dieta hiposódica, IMC 23 y exfumadora. Datos de la última analítica: Colesterol total 225 mg/dl; LDL colesterol: 123 mg/dl y glucosa 129 mg/dl. De las siguientes recomendaciones, ¿cuál estaría indicada para el control del riesgo cardiovascular?
1. Ejercicio anaeróbico regular con una duración mínima de 30 minutos por sesión.
2. Dieta hipocalórica de 1500 kcal.
3. Fomentar el consumo del coco por su efecto hipocolesterolémico.
4. Fomentar el consumo de esteroles naturales, así como de grasas mono y poliinsaturadas y fibra alimentaria.
5. Todas las respuestas anteriores son correctas.

Respuesta correcta: 4. Fomentar el consumo de esteroles naturales, así como de grasas mono y poliinsaturadas y fibra alimentaria.